Clinical trial exclusion criterion:
History of receiving any investigational treatment within approximately 28 days prior to randomization.

Entity relations:
- Has_temporal("investigational treatment", "within approximately 28 days prior to randomization")
- Has_index("within approximately 28 days prior to randomization", "randomization")
- Has_temporal("investigational treatment", "History of")